Healthy men and women, age 40-75 yrs, without any disease and need of medication.

The above is a clinical trial inclusion criterion. Annotated with entity spans:
[Observation: Healthy] [Person: men] and [Person: women], [Person: age] [Value: 40-75 yrs], [Negation: without] [Condition: any disease] and [Mood: need of] [Drug: medication].